Clinical trial inclusion criterion:
Absence of severe angina

Annotated entities:
- Negation: "Absence of"
- Condition: "angina"
- Qualifier: "severe"